En el estrés oxidativo es característico:
1. Disminución de la concentración de glutatión oxidado.
2. Aumento de la concentración de glutatión reducido.
3. Disminución de la producción de especies reactivas de oxígeno.
4. Aumento de la producción de especies reactivas de oxígeno.
5. Ninguna de las anteriores es cierta.

Respuesta correcta: 4. Aumento de la producción de especies reactivas de oxígeno.